Clinical trial inclusion criterion:
Diagnosis of probable pancreatic cancer, distal common bile duct (CBD) cholangiocarcinoma and other periampullary cancers (histology not required)

Entity relations:
- Has_qualifier("periampullary cancers", "other")
- Has_mood("pancreatic cancer", "probable")
- OR("pancreatic cancer", "distal common bile duct (CBD) cholangiocarcinoma", "periampullary cancers")